Poorly managed diet controlled diabetes (with HbA1c > 6.5% , not currently taking any glucose lowering therapy, meeting BMI inclusion range)

The above is a clinical trial inclusion criterion. Annotated with entity spans:
Poorly managed diet controlled [Condition: diabetes] (with [Measurement: HbA1c] [Value: > 6.5%] , [Negation: not] currently taking any [Procedure: glucose lowering therapy], meeting BMI inclusion range)